Which proteins does the p85α interact with?

p85α interacts with itself, with p110α and with p110d